Clinical trial inclusion criterion:
Patients aged between 40 and 60 years old.

Annotated entities:
- Person: "aged"
- Value: "between 40 and 60 years old"